Clinical trial exclusion criterion:
Prior history of citalopram treatment failure at appropriate doses and duration

Entity relations:
- Has_qualifier("treatment", "failure")
- AND("treatment", "citalopram")
- AND("history", "treatment")
- Has_temporal("treatment", "Prior")